下列何者為使用真空吸引器（vacuum extraction）的禁忌症？
A. 胎兒為面產式（face presentation）
B. 妊娠35週
C. 羊膜絨毛膜發炎（chorioamnionitis）
D. 過期妊娠（post-term pregnancy）

正確答案：A. 胎兒為面產式（face presentation）